下列何者並非動脈硬化獨立的危險因子？
A. 低密度脂蛋白（LDL cholesterol）過高
B. 吸菸
C. 肥胖
D. 糖尿病

正確答案：C. 肥胖